How is the STING protein activated?

During DNA virus infections, detection of cytosolic DNA by the cGAS-STING pathway leads to activation of IFN-β.